Clinical trial exclusion criterion:
Left ventricular hypertrophy by echocardiography or ECG

Annotated entities:
- Condition: "Left ventricular hypertrophy"
- Procedure: "echocardiography"
- Procedure: "ECG"